腦中風病人半側偏癱及感覺受損，患側下肢動作明顯比上肢靈活，則病灶最可能在：
A. 前大腦動脈（anterior cerebral artery）
B. 中大腦動脈（middle cerebral artery）
C. 後大腦動脈（posterior cerebral artery）
D. 脊椎動脈（vertebral artery）

正確答案：B. 中大腦動脈（middle cerebral artery）